Los fármacos que no están clasificados farmacológicamente como analgésicos, pero que se usan solos o asociados a fármacos de la escalera analgésica de la OMS (Organización Mundial de la Salud) para el control del dolor, se conocen como:
1. Antagonistas.
2. Coadyuvantes.
3. Nocebos.
4. Secundarios.

Respuesta correcta: 2. Coadyuvantes.